Please list 2 human diseases caused by a coronavirus.

MERS and SARS are 2 human diseases caused by coronaviruses